What are the five traits associated with metabolic syndrome?

Metabolic syndrome is the concurrent presentation of multiple cardiovascular factors, including obesity, insulin resistance, type 1 diabetes, type 2 diabetes, and hypertension.